新生兒出生後即發現肌肉張力不佳無哭聲，經保溫、擦乾、清除口鼻分泌物與重新擺位後，心跳仍每分鐘40 次且無自發性呼吸。接下來何種處置最為恰當？
A. 給與自由流量氧氣
B. 以甦醒球做正壓換氣
C. 開始胸外按壓心臟
D. 先評估Apgar score再決定下一步動作

正確答案：B. 以甦醒球做正壓換氣